Age =1 year, stratified into different age groups

The above is a clinical trial inclusion criterion. Annotated with entity spans:
[Person: Age] [Value: =1 year], [Non-representable: stratified into different age groups]